Clinical trial inclusion criterion:
9. Patient or parent/guardian capable of providing informed consent.

Annotated entities:
- Parsing_Error: "9."
- Post-eligibility: "Patient or parent/guardian capable of providing informed consent"
- Non-query-able: "Patient or parent/guardian capable of providing informed consent."